Sleep apnea by polysomnography

The above is a clinical trial exclusion criterion. Annotated with entity spans:
[Condition: Sleep apnea] by [Procedure: polysomnography]